Clinical trial exclusion criterion:
Allergic to studied drugs or metal materials.

Annotated entities:
- Condition: "Allergic"
- Drug: "studied drugs"
- Drug: "studied metal materials"